Patients who have received an investigational drug in the 30 days before study drug administration, or will receive one within 72 h afterwards,.

The above is a clinical trial exclusion criterion. Annotated with entity spans:
[Non-query-able: Patients who have received an investigational drug in the 30 days before study drug administration, or will receive one within 72 h afterwards,.]